Subjects with abnormal estimated glomerular filtration rate (eGFR).

The above is a clinical trial exclusion criterion. Annotated with entity spans:
Subjects with [Value: abnormal] [Measurement: estimated glomerular filtration rate (eGFR)].